PBT2 has been tested for which disorder?

PBT2 has been tested for treatment of Alzheimer's disease.